Clinical trial inclusion criterion:
simple obesity

Annotated entities:
- Condition: "simple obesity"